Histologically proven recurrent or persistent squamous cell carcinoma, adenosquamous carcinoma, or adenocarcinoma of the cervix that is not amenable to curative treatment with surgery and/or radiation therapy AND has failed 2 previous treatment regimens.

The above is a clinical trial inclusion criterion. Annotated with entity spans:
[Measurement: Histologically] [Value: proven] [Qualifier: recurrent] or [Qualifier: persistent] [Condition: squamous cell carcinoma], [Condition: adenosquamous carcinoma], or [Condition: adenocarcinoma of the cervix] that is [Negation: not] [Qualifier: amenable to curative treatment] with [Procedure: surgery] and/or [Procedure: radiation therapy] AND has failed [Value: 2] [Temporal: previous] [Procedure: treatment regimens].